下列有關視神經盤（optic disc）的敘述，何者錯誤？
A. 視神經盤和黃斑（macula densa）是視網膜（retina）上兩個不同的構造
B. 視神經盤富含光感受器（photoreceptor）
C. 視神經盤為視網膜與視神經（optic nerve）交界處
D. 視野（visual field）檢查的盲點（blind spot）位於視神經盤

正確答案：B. 視神經盤富含光感受器（photoreceptor）